Clinical trial exclusion criteria:
Patients with severe-complicated disease that would compromise oral therapy (hypotenstion or shock, ileus or bowel obstruction, megacolon).
Patients with an allergy to oral vancomycin or fidaxomicin.
Patients anticipated to receive metronidazole after enrollment.
Patients who already received oral vancomycin or metronidazole (either oral or intravenous) for > 24 hours within the preceding 72 hours at the time of enrollment.
Patients anticipated to receive adjunctive C. difficile therapy (rifaxamin, nitazoxanide, tigecycline) after enrollment.

Annotated entities:
- Condition: "hypotenstion"
- Condition: "shock"
- Condition: "ileus"
- Condition: "bowel obstruction"
- Condition: "megacolon"
- Non-query-able: "Patients with severe-complicated disease that would compromise oral therapy"
- Condition: "allergy"
- Drug: "vancomycin"
- Drug: "fidaxomicin"
- Qualifier: "oral"
- Drug: "metronidazole"
- Mood: "anticipated"
- Drug: "vancomycin"
- Drug: "metronidazole"
- Qualifier: "oral"
- Multiplier: "> 24 hours"
- Temporal: "preceding 72 hours at the time of enrollment."
- Reference_point: "enrollment"
- Mood: "anticipated"
- Procedure: "C. difficile therapy"
- Drug: "rifaxamin"
- Drug: "nitazoxanide"
- Drug: "tigecycline"